Clinical trial exclusion criterion:
Drugs related to acetylcholine metabolism

Entity relations:
- Has_qualifier("Drugs", "related to acetylcholine metabolis")